Clinical trial exclusion criterion:
Patients with dexamethasone intolerance.

Annotated entities:
- Drug: "dexamethasone"
- Condition: "intolerance"